Clinical trial exclusion criterion:
History of cochlear implant

Entity relations:
- Has_temporal("cochlear implant", "History")